Clinical trial exclusion criterion:
Infection requiring systemic antibiotic therapy or other serious infection within 14 days before study enrollment.

Annotated entities:
- Condition: "Infection"
- Procedure: "systemic antibiotic therapy"
- Qualifier: "other"
- Qualifier: "serious"
- Condition: "infection"
- Temporal: "within 14 days before study enrollment"